陳女士 50 歲為一乳癌患者經手術行 modified radical mastectomy 後，其 staging 為 T2N1M0，術後建議給予 6 次 5-FU，Adriamycin 及 cyclophosphamide。此種化學藥物治療屬於下列那一種？
A. 輔助性化療（adjuvant C/T）
B. 治療性化療（therapeutic C/T）
C. 姑息性化療（palliative C/T）
D. 主要性化療（primary C/T）

正確答案：A. 輔助性化療（adjuvant C/T）